Clinical trial inclusion criterion:
Patients intubated within one hour prior to care transition to the CICU will also be screened for inclusion.

Annotated entities:
- Procedure: "intubated"
- Temporal: "within one hour prior to care transition"
- Procedure: "care transition"
- Reference_point: "care transition"